Clinical trial exclusion criterion:
Heart failure or Chronic renal failure

Annotated entities:
- Condition: "Heart failure"
- Condition: "Chronic renal failure"